Clinical trial inclusion criteria:
Provide written, signed and dated informed consent prior to initiating any study-related activities.
Male or female >18 years of age at the time of screening
Fitzpatrick Skin phototype IV-VI, non-white race/ethnicity, including but not limited to - --African Americans, Asians, Pacific Islanders and Hispanics.
Clinical diagnosis of chronic plaque-type psoriasis of the body
Plaque psoriasis with =2% Body Surface Area (BSA) involvement (may include scalp involvement), PASI Score = 2, IGA mod 2011 score of 2 or greater (based on scale of 0-4)
Females of childbearing potential (FCBP) must have a negative pregnancy test at Screening and Baseline. While using investigational product and for at least 28 days after last application of investigational product, FCBP who engage in activity in which conception is possible must use one of the approved contraceptive options d
Must be in general good health as judged by the Investigator, based on medical history and physical examination.

Annotated entities:
- Informed_consent: "Provide written, signed and dated informed consent prior to initiating any study-related activities."
- Person: "Male"
- Person: "female"
- Value: ">18 years of age"
- Person: "age"
- Temporal: "at the time of screening"
- Reference_point: "the time of screening"
- Measurement: "Fitzpatrick Skin phototype"
- Value: "IV-VI"
- Person: "non-white race/ethnicity"
- Person: "African Americans"
- Person: "Asians"
- Person: "Pacific Islanders"
- Person: "Hispanics"
- Qualifier: "plaque-type"
- Qualifier: "chronic"
- Condition: "psoriasis of the body"
- Condition: "Plaque psoriasis"
- Value: "=2% Body Surface Area (BSA)"
- Measurement: "involvement"
- Measurement: "PASI Score"
- Value: "= 2"
- Measurement: "IGA mod 2011 score"
- Value: "2 or greater"
- Qualifier: "scale of 0-4"
- Pregnancy_considerations: "Females of childbearing potential (FCBP) must have a negative pregnancy test at Screening and Baseline. While using investigational product and for at least 28 days after last application of investigational product, FCBP who engage in activity in which conception is possible must use one of the approved contraceptive options d"
- Non-query-able: "Must be in general good health as judged by the Investigator, based on medical history and physical examination"